下列關於熱性痙攣之敘述，何者正確？
A. 複雜型熱性痙攣之病人，未來發生癲癇的機會與一般族群相同
B. 年紀小於6個月之熱性痙攣患者，須做腰椎穿刺排除中樞神經感染之可能性
C. 首次發生單純型熱性痙攣，大多須安排神經影像檢查以排除腦部構造異常
D. 熱性痙攣之發生與基因或家族史無關

正確答案：B. 年紀小於6個月之熱性痙攣患者，須做腰椎穿刺排除中樞神經感染之可能性